目前偵測早期腦梗塞，最敏銳的影像檢查是：
A. diffusion-weighted magnetic resonance image
B. T2-weighted magnetic resonance image
C. computed tomography
D. T1-weighted magnetic resonance image

正確答案：A. diffusion-weighted magnetic resonance image